62歲的老師上課中突然變得怪異，重複問同樣的問題。他的意識清楚、手腳靈活，最近沒有頭部外傷。被送到鄰近醫院檢查，6小時後，逐漸恢復正常，但是對過去幾個小時完全沒有記憶。他最有可能的情況為：
A. 暫時性失憶症（transient global amnesia）
B. 阿茲海默症（Alzheimer disease）
C. 額顳葉失智症（frontotemporal dementia）
D. 枕葉癲癇發作（occipital seizure）

正確答案：A. 暫時性失憶症（transient global amnesia）